chromosomal abnormality

The above is a clinical trial exclusion criterion. Annotated with entity spans:
[Condition: chromosomal abnormality]